Clinical trial exclusion criterion:
Skin and perineal disease with risk of infection

Annotated entities:
- Condition: "perineal disease"
- Condition: "Skin disease"
- Observation: "risk of infection"
- Parsing_Error: "and"